History of gastro-intestinal or other organ bleeding

The above is a clinical trial inclusion criterion. Annotated with entity spans:
[Temporal: History] of [Condition: gastro-intestinal] or [Qualifier: other] [Condition: organ bleeding]